Clinical trial exclusion criterion:
Current treatment with cholestyramine or cholestipol resins

Annotated entities:
- Drug: "cholestyramine"
- Drug: "cholestipol resins"
- Temporal: "Current"